Clinical trial inclusion criterion:
Age between 18 and 80 years

Entity relations:
- Has_value("Age", "between 18 and 80 years")